Drug-related liver disease

The above is a clinical trial exclusion criterion. Annotated with entity spans:
[Condition: Drug-related liver disease]